History of intracranial hypertension

The above is a clinical trial exclusion criterion. Annotated with entity spans:
[Temporal: History] of [Condition: intracranial hypertension]